下列那種酵素活性高低會影響 NADPH 的形成以及 glutathione 的還原狀態？
A. Glucose 6-phosphate dehydrogenase
B. Pyruvate dehydrogenase
C. Lactate dehydrogenase
D. Alcohol dehydrogenase

正確答案：A. Glucose 6-phosphate dehydrogenase